若一位女性的生理月經週期是28天，	床窗期（implantation window）最有可能是在月經來潮後的第幾天？
A. 12～15天
B. 16～19天
C. 20～24天
D. 25～27天

正確答案：C. 20～24天